Clinical trial exclusion criterion:
5. Are not scheduled to undergo conventional ultrasound

Entity relations:
- Has_negation("conventional ultrasound", "not")
- Has_mood("conventional ultrasound", "scheduled")